Clinical trial exclusion criterion:
Patients using any herbal psychoactive treatments, e.g. St John's Wort, Valerian, Kava Kava, L-tryptophan.

Annotated entities:
- Procedure: "herbal psychoactive treatments"
- Drug: "St John's Wort"
- Drug: "Valerian"
- Drug: "Kava Kava"
- Drug: "L-tryptophan"